Clinical trial exclusion criterion:
Hyperthyroidism or hypothyroidism.

Annotated entities:
- Condition: "Hyperthyroidism"
- Condition: "hypothyroidism"